What genes is implicated in myotonic goats and other  nondystrophic myotonias?

The genes that are implicated in myotonic goats and other nondystrophic myotonias are clcn1, mbnl1, gcic-1, scn4a, clc-1 and dmpk.